cyclosporine, or

The above is a clinical trial exclusion criterion. Annotated with entity spans:
[Drug: cyclosporine], or